Which Python tool has been developed for network-based stratification of tumor mutations?

PyNBS is a modularized Python 2.7 implementation of the network-based stratification (NBS) algorithm for stratifying tumor somatic mutation profiles into molecularly and clinically relevant subtypes.